Women who are pregnant or breastfeeding.

The above is a clinical trial exclusion criterion. Annotated with entity spans:
[Pregnancy_considerations: Women who are pregnant or breastfeeding].